Pregnancy (present, suspected, or planned)

The above is a clinical trial exclusion criterion. Annotated with entity spans:
[Condition: Pregnancy] ([Temporal: present], [Mood: suspected], or [Mood: planned])